Clinical trial exclusion criterion:
Use of Traditional Chinese Medication or alternative therapies

Annotated entities:
- Procedure: "Traditional Chinese Medication"
- Procedure: "alternative therapies"